surgical interventions within the last 4 days,

The above is a clinical trial exclusion criterion. Annotated with entity spans:
[Procedure: surgical interventions] within the [Temporal: last 4 days],